History of bupivacaine allergy

The above is a clinical trial exclusion criterion. Annotated with entity spans:
[Temporal: History] of [Drug: bupivacaine] [Condition: allergy]